Clinical trial exclusion criterion:
Intravenous (IV) iron administered within 4 weeks prior to Screening

Entity relations:
- Subsumes("Intravenous", "IV")
- Has_qualifier("iron", "Intravenous")
- Has_index("within 4 weeks prior to Screening", "Screening")
- Has_temporal("iron", "within 4 weeks prior to Screening")